Clinical trial exclusion criterion:
6. Oral steroids unless patients present a low stable dose (e.g. 10 mg or less of prednisone per day or physiological doses, less than 35 mg/day, of hydrocortisone Cortef®). Inhale steroids at stable dose in the last month are acceptable.

Entity relations:
- Subsumes("hydrocortisone", "Cortef")
- Subsumes("physiological doses", "less than 35 mg/day")
- Has_multiplier("hydrocortisone", "physiological doses")
- Has_multiplier("prednisone", "10 mg or less per day")
- Subsumes("low dose", "prednisone")
- Has_negation("low dose", "unless")
- Has_negation("stable dose", "unless")
- Has_qualifier("Oral steroids", "stable dose")
- Has_qualifier("Oral steroids", "low dose")
- Has_qualifier("Inhale steroids", "stable dose")
- Has_temporal("Inhale steroids", "in the last month")
- OR("prednisone", "hydrocortisone")